Past or concurrent history of neoplasm other than stomach cancer, except for curatively treated non-melanoma skin cancer or in situ carcinoma of the cervix uteri

The above is a clinical trial exclusion criterion. Annotated with entity spans:
Past or concurrent [Temporal: history of] [Condition: neoplasm] [Negation: other than] [Condition: stomach cancer], [Negation: except for] [Qualifier: curatively] [Procedure: treated] [Condition: non-melanoma skin cancer] or [Condition: in situ carcinoma of the cervix uteri]